4. Known left-sided endocarditis or prosthetic heart valve.

The above is a clinical trial exclusion criterion. Annotated with entity spans:
4. Known [Condition: left-sided endocarditis] or [Device: prosthetic heart valve].